關於肝硬化所導致的食道靜脈曲張（esophageal varices），以下敘述何者正確？
A. 非選擇性的beta 阻斷劑（nonselective β-blockers），如propranolol或nadolol，可以降低第一次靜脈曲張出血
B. 內視鏡靜脈曲張結紮（endoscopic variceal ligation），對於預防第一次靜脈曲張出血的效果並不好
C. 內視鏡靜脈曲張結紮，因可以降低肝門靜脈壓力，所以可以用來治療靜脈曲張出血
D. 靜脈曲張出血的病人，最好能輸血將血紅素維持在10 g/dL以上

正確答案：A. 非選擇性的beta 阻斷劑（nonselective β-blockers），如propranolol或nadolol，可以降低第一次靜脈曲張出血